Clinical trial exclusion criterion:
History of stroke within 3 months;

Annotated entities:
- Condition: "stroke"
- Value: "within 3 months"